Clinical trial inclusion criterion:
Maximum 12 cm.

Annotated entities:
- Non-representable: "Maximum 12 cm."